Clinical trial inclusion criteria:
H pylori infection failed after at least two eradication therapies
aged 20 years or greater
willingness to receive rescue therapy

Annotated entities:
- Condition: "H pylori infection"
- Procedure: "eradication therapies"
- Multiplier: "at least two"
- Qualifier: "failed"
- Person: "aged"
- Value: "20 years or greater"
- Mood: "willingness"
- Procedure: "rescue therapy"